下列何種組合是 Alzheimer's disease 的病理診斷特徵？
A. Neurofibrillary tangles 與 Lewy body
B. Senile plaques 與 Giant cells
C. Neurofibrillary tangles 與 Senile plaques
D. Lewy body 與 Giant cells

正確答案：C. Neurofibrillary tangles 與 Senile plaques